Clinical trial inclusion criterion:
willingness to wear the insulin pump

Entity relations:
- multi("wear the insulin pump", "insulin pump")
- Has_mood("wear the insulin pump", "willingness")